Mini Mental Status (MMS) test between 16 to 26 inclusive

The above is a clinical trial inclusion criterion. Annotated with entity spans:
[Measurement: Mini Mental Status (MMS) tes]t [Value: between 16 to 26 inclusive]